Patients with reduced ejection fraction (= 40%) as confirmed at any time point in the patient's medical history.

The above is a clinical trial inclusion criterion. Annotated with entity spans:
Patients with reduced [Measurement: ejection fraction] ([Value: = 40%]) as confirmed at any time point in the patient's medical history.